下列何者與癩皮病（pellagra）無關？
A. 缺乏維生素B6（pyridoxine）
B. 缺乏維生素C（ascorbic acid）
C. 缺乏維生素B3（niacin）
D. 長期使用isoniazid的病人

正確答案：B. 缺乏維生素C（ascorbic acid）